Patient has a prostate size between 90g and 200g, as determined by MRI

The above is a clinical trial inclusion criterion. Annotated with entity spans:
Patient has a [Measurement: prostate size] [Value: between 90g and 200g], as determined by [Procedure: MRI]